Immunosuppressed/immune compromised

The above is a clinical trial exclusion criterion. Annotated with entity spans:
[Condition: Immunosuppressed]/[Condition: immune compromised]